Clinical trial exclusion criterion:
Patients with a "currently active" second malignancy other than non-melanoma skin cancers are not eligible. Patients are not considered to have a "currently active" malignancy if they have completed all therapy and are now considered without evidence of disease for 1 year. Patients with cognitive dysfunction related to treatment of another malignancy, including a history of "chemo-brain", are ineligible.

Annotated entities:
- Multiplier: "second"
- Condition: "malignancy"
- Qualifier: "currently active"
- Condition: "non-melanoma skin cancers"
- Negation: "other than"
- Condition: "cognitive dysfunction"
- Procedure: "treatment"
- Qualifier: "another"
- Condition: "malignancy"